Clinical trial inclusion criterion:
Grade 0 finger/thumb extension at 6 months

Annotated entities:
- Measurement: "extension"
- Qualifier: "thumb"
- Qualifier: "finger"
- Value: "Grade 0"
- Temporal: "at 6 months"